Estimula la separación de las hebras de DNA durante la replicación:
1. Primasa
2. DNA ligasa.
3. Las proteínas de unión al DNA de cadena sencilla.
4. Helicasa.
5. DNA polimerasa I.

Respuesta correcta: 4. Helicasa.